Patients undergoing colon resection

The above is a clinical trial inclusion criterion. Annotated with entity spans:
Patients [Temporal: undergoing] [Condition: colon resection]